Clinical trial exclusion criterion:
Soft drusen in treated eye or fellow eye, signs of choroidal neovascularization on ophthalmoscopy and/or FA/ICGA of the study eye.

Annotated entities:
- Condition: "Soft drusen"
- Qualifier: "treated eye"
- Qualifier: "fellow eye"
- Condition: "choroidal neovascularization"
- Procedure: "ophthalmoscopy"
- Procedure: "FA"
- Procedure: "ICGA"
- Qualifier: "study eye"